Which disease the skin condition Necrobiosis lipoidica diabeticorum is associated to?

Necrobiosis lipoidica diabeticorum (NLD) is a rare, granulomatous inflammatory skin disease of unknown origin, sometimes associated with diabetes mellitus.